Adults (18 and older) with physiologically confirmed SA or mild-moderate asthma and followed by an asthma specialist for at least 6 months.

The above is a clinical trial inclusion criterion. Annotated with entity spans:
[Person: Adults] ([Value: 18 and older]) with physiologically confirmed [Condition: SA] or [Qualifier: mild]-[Qualifier: moderate] [Condition: asthma] and [Observation: followed by an asthma specialist] [Temporal: for at least 6 months].